Clinical trial exclusion criterion:
major systemic disease

Annotated entities:
- Condition: "major systemic disease"